有關吸食強力膠的相關敘述，下列何者正確？
A. 所產生的作用類似於中樞神經抑制劑（CNS depressant），如酒精
B. 長期吸食者常常容易產生戒斷症狀
C. 長期吸食者的腦部斷層掃描，易發現有小區域之梗塞（infarction）
D. 因其藥物作用時間短，懷孕期間持續吸食對於胎兒影響不大

正確答案：A. 所產生的作用類似於中樞神經抑制劑（CNS depressant），如酒精